在急性隅角閉鎖性青光眼（acute angle-closure glaucoma），下列那一種情形較不可能發生？
A. 結膜充血
B. 角膜水腫
C. 半放大之瞳孔
D. 視神經盤凹陷（cup/disc ratio）擴大

正確答案：D. 視神經盤凹陷（cup/disc ratio）擴大